Clinical trial exclusion criterion:
Thalassemia syndromes;

Annotated entities:
- Condition: "Thalassemia syndromes"